Male

The above is a clinical trial inclusion criterion. Annotated with entity spans:
[Person: Male]